Significant O2 desaturation (SpO2 < 85%) at rest or during exercise

The above is a clinical trial exclusion criterion. Annotated with entity spans:
[Qualifier: Significant] [Condition: O2 desaturation] ([Measurement: SpO2] [Value: < 85%]) [Qualifier: at rest] or [Qualifier: during exercise]